aged 18 or older

The above is a clinical trial inclusion criterion. Annotated with entity spans:
[Person: aged] [Value: 18 or older]